Clinical trial inclusion criterion:
Blasts = 1,000/µL in PB on day 8

Annotated entities:
- Line: "Blasts = 1,000/µL in PB on day 8"
- Measurement: "Blasts"
- Value: "= 1,000/µL"
- Qualifier: "PB"
- Temporal: "on day 8"